Informed consent about histological examination (core cut biopsy (CCB), vacuum-assisted biopsy (VAB), fine needle aspiration (FNA) or surgery) has already been given in the course of clinical routine

The above is a clinical trial inclusion criterion. Annotated with entity spans:
[Post-eligibility: Informed consent] about [Procedure: histological examination] ([Procedure: core cut biopsy (CCB)], [Procedure: vacuum-assisted biopsy (VAB)], [Procedure: fine needle aspiration (FNA)] or [Procedure: surgery]) has already been given in the course of clinical routine